下列何種形式的缺氧（hypoxia）其動脈血氧分壓會下降？
A. Hypoxic hypoxia
B. Anemic hypoxia
C. Stagnant or ischemic hypoxia
D. Histotoxic hypoxia

正確答案：A. Hypoxic hypoxia